下列何者附	於肩胛棘（spine of scapula）？
A. 斜方肌（trapezius muscle）
B. 提肩胛肌（levator scapulae muscle）
C. 後上鋸肌（serratus posterior superior muscle）
D. 後下鋸肌（serratus posterior inferior muscle）

正確答案：A. 斜方肌（trapezius muscle）